Drug allergy

The above is a clinical trial exclusion criterion. Annotated with entity spans:
[Drug: Drug] [Condition: allergy]